下列何者為最常造成胎兒子宮內肢體缺損（intrauterine amputation）的原因？
A. 羊膜帶症候群（amniotic band syndrome）
B. 臍帶纏繞（cord entanglement）
C. 產婦創傷病史（maternal trauma）
D. 血管阻塞（vascular occlusion）

正確答案：A. 羊膜帶症候群（amniotic band syndrome）